Clinical trial exclusion criterion:
Known allergy to any drug used

Annotated entities:
- Condition: "Known allergy"
- Drug: "any drug used"